A MoCA score between 19 and 28 (inclusive) at screening. For those on cognitive enhancers (donepezil, rivastigmine, memantine, galantamine) a MoCA score between 19 and 29 (inclusive) at screening.

The above is a clinical trial inclusion criterion. Annotated with entity spans:
A [Measurement: MoCA score] [Value: between 19 and 28] (inclusive) at screening. For those on [Procedure: cognitive enhancers] ([Drug: donepezil], [Drug: rivastigmine], [Drug: memantine], [Drug: galantamine]) a [Measurement: MoCA score] [Value: between 19 and 29] (inclusive) at screening.